Painful regular uterine contraction and/or preterm labor

The above is a clinical trial exclusion criterion. Annotated with entity spans:
[Condition: Painful regular uterine contraction] and/or [Condition: preterm labor]